The subject has had another active malignancy within the past 5 years except for cervical cancer in situ, in situ carcinoma of the bladder or non-melanoma carcinoma of the skin.

The above is a clinical trial exclusion criterion. Annotated with entity spans:
The subject has had another [Condition: active malignancy] [Temporal: within the past 5 years] [Negation: except] for [Condition: cervical cancer in situ], [Condition: in situ carcinoma of the bladder] or [Condition: non-melanoma carcinoma of the skin].